Known untreated B12 deficiency or malnutrition (body mass index [BMI] less than 18) at screening

The above is a clinical trial exclusion criterion. Annotated with entity spans:
Known [Qualifier: untreated] [Condition: B12 deficiency] or [Condition: malnutrition] ([Measurement: body mass index [BMI]] [Value: less than 18]) [Temporal: at screening]